Clinical trial exclusion criterion:
Clinical conditions.

Annotated entities:
- Non-representable: "Clinical conditions."